Clinical trial exclusion criteria:
Serious suicidal tendency
The score of the sixth item of HAMA =3
The score of HAMD =21
Pregnant or lactating women
History of allergic or hypersensitivity to tandospirone
Serious or unstable cardiac, renal, neurologic, cerebrovascular, metabolic, or pulmonary disease
Secondary anxiety disorders
Drug or alcohol dependence within 1 year
Patients currently taking benzodiazepine drugs
Drivers and dangerous machine operators
Participated in other clinical studies in the last 30 days
Patients with clinically significant ECG or laboratory abnormalities
Patients with a history of epilepsy
Patients with abnormal TSH concentration

Annotated entities:
- Condition: "suicidal tendency"
- Measurement: "score of the sixth item of HAMA"
- Value: "=3"
- Measurement: "score of HAMD"
- Value: "=21"
- Condition: "Pregnant"
- Condition: "lactating"
- Person: "women"
- Condition: "hypersensitivity"
- Drug: "tandospirone"
- Condition: "allergic"
- Qualifier: "tandospirone"
- Condition: "cardiac disease"
- Condition: "renal disease"
- Condition: "neurologic disease"
- Condition: "cerebrovascular disease"
- Condition: "metabolic disease"
- Condition: "pulmonary disease"
- Qualifier: "unstable"
- Qualifier: "Serious"
- Condition: "Secondary anxiety disorders"
- Condition: "alcohol dependence"
- Condition: "Drug dependence"
- Temporal: "within 1 year"
- Procedure: "benzodiazepine drugs"
- Temporal: "currently"
- Person: "Drivers"
- Person: "dangerous machine operators"
- Grammar_Error: "and"
- Observation: "Participated in other clinical studies"
- Temporal: "the last 30 days"
- Condition: "laboratory abnormalities"
- Condition: "ECG abnormalities"
- Procedure: "laboratory"
- Procedure: "ECG"
- Qualifier: "clinically significant"
- Condition: "epilepsy"
- Measurement: "TSH"
- Value: "abnormal"